What type of genome, (RNA or DNA, double stranded single stranded) is found in the the virus that causes blue tongue disease?

The Bluetongue virus (BTV) genome contains ten double-stranded RNA segments.